History of allergic reactions to phenylephrine or ephedrine

The above is a clinical trial exclusion criterion. Annotated with entity spans:
[Temporal: History] of [Condition: allergic reactions] to [Drug: phenylephrine] or [Drug: ephedrine]